下列那一項不是子宮頸癌的危險因子？
A. Early age at first intercourse
B. Multiple sexual partners
C. Cigarette smoking
D. Cytomegalovirus（CMV）infection

正確答案：D. Cytomegalovirus（CMV）infection